Clinical trial exclusion criterion:
Patients with second primary cancer, except:adequately treated non-melanoma skin cancer, curatively treated in-situ cancer of the cervix, or other solid tumor curatively treated with no evidence of disease for <= 5 years.

Entity relations:
- Has_qualifier("primary cancer,", "second")
- Has_mood("non-melanoma skin cancer", "treated")
- Has_mood("in-situ cancer of the cervix", "treated")
- Has_negation("non-melanoma skin cancer", "except")
- OR("non-melanoma skin cancer", "in-situ cancer of the cervix")